Male or non-pregnant female between the ages of 18-65

The above is a clinical trial inclusion criterion. Annotated with entity spans:
[Person: Male] or [Negation: non]-[Qualifier: pregnant] [Person: female] between the [Person: ages] of [Value: 18-65]